Person falls = once a week due to the reasons that could not be corrected by the new prosthesis (for ex. problems with vestibular system).

The above is a clinical trial exclusion criterion. Annotated with entity spans:
[Non-query-able: Person falls = once a week due to the reasons that could not be corrected by the new prosthesis (for ex. problems with vestibular system)].